Clinical trial inclusion criterion:
Patients eligible for PCI with application of DES, due to ACS.

Entity relations:
- AND("PCI", "DES")
- AND("PCI", "ACS")